白色念珠菌（Candida albicans）所引起的鵝口瘡多見於：
A. 新生嬰兒
B. 兒童
C. 青少年
D. 成年人

正確答案：A. 新生嬰兒